Has Barcelona Clinic Liver Cancer (BCLC) Stage C disease or BCLC Stage B disease not amenable to locoregional therapy or refractory to locoregional therapy and not amenable to a curative treatment approach

The above is a clinical trial inclusion criterion. Annotated with entity spans:
Has [Measurement: Barcelona Clinic Liver Cancer (BCLC)] [Value: Stage C] [Condition: disease] or [Measurement: BCLC] [Value: Stage B] [Condition: disease] [Negation: not] [Qualifier: amenable to locoregional therapy] or [Qualifier: refractory to locoregional therapy] and [Negation: not] [Qualifier: amenable to a curative treatment approach]